下列何者不是選擇性血清素再吸收抑制劑（SSRI）的副作用？
A. 血糖急速上升
B. 噁心
C. 性功能障礙
D. 睡眠障礙

正確答案：A. 血糖急速上升